Psychiatric and somatoform disorders

The above is a clinical trial exclusion criterion. Annotated with entity spans:
[Condition: Psychiatric] and [Condition: somatoform disorders]